Clinical trial exclusion criterion:
Unable to make appointments (every three to six months over 2 years).

Annotated entities:
- Post-eligibility: "Unable to make appointments (every three to six months over 2 years)."